Clinical trial exclusion criteria:
Cardiac arrest
Head trauma
Drowning
Congenital heart disease
Inborn errors of metabolism
Electrolyte imbalance (hypocalcaemia, hyponatremia and hypoglycemia)
Hemodynamic instability
Allergy to benzodiazepines
Focal seizures with preserved level of consciousness

Annotated entities:
- Condition: "Cardiac arrest"
- Condition: "Head trauma"
- Condition: "Drowning"
- Condition: "Congenital heart disease"
- Condition: "Inborn errors of metabolism"
- Condition: "Electrolyte imbalance"
- Condition: "hypocalcaemia"
- Condition: "hyponatremia"
- Condition: "hypoglycemia"
- Condition: "Hemodynamic instability"
- Condition: "Allergy"
- Drug: "benzodiazepines"
- Condition: "Focal seizures"
- Condition: "preserved level of consciousness"